下列有關顱內動靜脈畸形（arteriovenous malformation, AVM）的敘述，何者錯誤？
A. AVM的組成包括灌流的動脈，引流的靜脈，交通動靜脈的微血管
B. AVM常出現的症狀包括有出血、癲癇及局部缺血
C. 雖然CT及MRI可以診斷，但最好的診斷工具為顱內四條血管的血管攝影（four -vessels cerebral
D. AVM 24小時內再出血的機率比動脈瘤低

正確答案：A. AVM的組成包括灌流的動脈，引流的靜脈，交通動靜脈的微血管